What is the use of Brain Metastasis Velocity (BMV) Model?

Brain metastasis velocity (BMV) is a metric that describes the rate of development of new brain metastases (BM) after initial stereotactic radiosurgery.